Hombre de 26 años, soltero, que es traído a consulta por su familia por llevar 3 meses negándose a salir se su casa. La razón que aduce el paciente es el convencimiento de que tiene la mandíbula asimétrica y la cara torcida. Según refiere esta situación es progresiva y cada vez se ve mas deforme cuando se observa en el espejo. Se avergüenza de su aspecto, por lo que no quiere salir, se angustia mucho cuando ve su imagen y no puede dejar de pensar todo el día en su deformidad. Ha consultado con varios cirujanos maxilofaciales pero éstos le dicen que no presenta asimetría facial y lo remiten al psiquiatra. El diagnóstico del paciente es:
1. Trastorno depresivo mayor con ideas delirantes incongruentes con el estado de ánimo.
2. Trastorno obsesivo compulsivo.
3. Esquizofrenia paranoide.
4. Trastorno dismórfico corporal.

Respuesta correcta: 4. Trastorno dismórfico corporal.